7. Medical conditions expected to progress, recur, or change to such a degree to interfere with the assessment of the clinical and mental status.

The above is a clinical trial exclusion criterion. Annotated with entity spans:
[Parsing_Error: 7.] [Undefined_semantics: Medical conditions expected to progress, recur, or change to such a degree to interfere with the assessment of the clinical and mental status.]